下列何者為臨床上最常被用來測量肺部氣體擴散率（diffusion rate）的氣體？
A. Carbon dioxide
B. Carbon monoxide
C. Helium
D. Nitrogen

正確答案：B. Carbon monoxide